Normal renal and hepatic laboratory profiles

The above is a clinical trial inclusion criterion. Annotated with entity spans:
[Value: Normal] [Measurement: renal] and [Measurement: hepatic laboratory profile]s